Clinical trial inclusion criterion:
• Family history of SpA (presence of ankylosing spondylitis, psoriasis, acute uveitis, reactive arthritis, or IBD)

Entity relations:
- Subsumes("SpA", "ankylosing spondylitis")
- Has_context("SpA", "Family history")
- OR("ankylosing spondylitis", "reactive arthritis", "acute uveitis", "psoriasis", "IBD")